History of shoulder tumor

The above is a clinical trial exclusion criterion. Annotated with entity spans:
[Temporal: History of] [Condition: shoulder tumor]